Clinical trial inclusion criterion:
Healthy patients age 18 and older

Annotated entities:
- Condition: "Healthy"
- Person: "age"
- Value: "18 and older"